Clinical trial inclusion criterion:
C-reactive protein > 15 mg/l (three fold higher than the upper limit of normal)

Annotated entities:
- Measurement: "C-reactive protein"
- Value: "> 15 mg/l"
- Value: "three fold higher than the upper limit of normal"